Acude a la consulta por primera vez Christina, una joven de 20 años de origen nórdico que lleva viviendo en España seis meses. Durante la entrevista refiere que “a pesar de que al comienzo fue difícil, ahora he comenzado a sentirme parte del pueblo” Christina reside en una pequeña localidad gallega con sus padres y desde hace un par de meses ha comenzado la universidad, donde se ha integrado formando un pequeño grupo de amigos con los que participa en la organización de las fiestas locales. Esta situación describe el concepto de:
1. Subcultura.
2. Asimilación.
3. Aculturación.
4. Estereotipo.

Respuesta correcta: 2. Asimilación.